人體攝取下列何種食物時，所造成之呼吸商（respiratory quotient）最高？
A. 僅含有碳水化合物之食物
B. 僅含有脂肪之食物
C. 僅含有蛋白質之食物
D. 混含碳水化合物、脂肪、蛋白質之食物

正確答案：A. 僅含有碳水化合物之食物